Clinical trial inclusion criterion:
Ages =18 years old, < 80 years old;

Annotated entities:
- Person: "Ages"
- Value: "=18 years old, < 80 years old"